Clinically stable;

The above is a clinical trial inclusion criterion. Annotated with entity spans:
[Condition: Clinically stable];